Clinical trial inclusion criterion:
Male sex

Annotated entities:
- Person: "Male"